NIHSS: 4-25;

The above is a clinical trial inclusion criterion. Annotated with entity spans:
[Measurement: NIHSS]: [Value: 4-25];